Clinical trial exclusion criterion:
History of drug abuse or alcohol abuse in the past 12 months.

Annotated entities:
- Observation: "alcohol abuse"
- Observation: "drug abuse"
- Temporal: "in the past 12 months"
- Temporal: "History"